Clinical trial inclusion criterion:
Not diabetic

Annotated entities:
- Condition: "diabetic"
- Negation: "Not"